What is the Barr body?

The Barr body is the inactive X chromosome in a female somatic cell.